under 18 or over 50 years of age

The above is a clinical trial exclusion criterion. Annotated with entity spans:
[Value: under 18 or over 50 years] of [Person: age]